Clinical trial exclusion criterion:
Pouch stones

Annotated entities:
- Condition: "Pouch stones"